Clinical trial inclusion criterion:
having primary corrective heart surgery

Entity relations:
- Has_qualifier("corrective heart surgery", "primary")